Clinical trial inclusion criterion:
Tissue from tumor must be available. This may be paraffin embedded tissue from previous biopsy/resection or if it is not available, a repeat biopsy must be performed. The requirement for biopsy may be waived if alpha-fetoprotein is greater than 500 ng/mL and in the investigators opinion not explained by a concurrent hepatic inflammatory process.

Entity relations:
- Has_value("alpha-fetoprotein", "greater than 500 ng/mL")
- Subsumes("biopsy", "alpha-fetoprotein")